Clinical trial exclusion criterion:
unstable condition on anti-parkinsonian medications;

Annotated entities:
- Condition: "unstable condition"
- Drug: "anti-parkinsonian medications"
- Undefined_semantics: "unstable condition on anti-parkinsonian medications"